Clinical trial inclusion criterion:
=6 weeks postnatal age at randomization

Annotated entities:
- Measurement: "postnatal age"
- Temporal: "at randomization"
- Value: "=6 weeks"